Clinical trial inclusion criterion:
Subject must be able to read in a language supported by the smart phone app in their region.

Annotated entities:
- Non-query-able: "Subject must be able to read in a language supported by the smart phone app in their region."